Clinical trial inclusion criterion:
Less than 24 hours since bite, AND

Annotated entities:
- Temporal: "Less than 24 hours since bite"
- Reference_point: "bite"
- Condition: "bite"